Clinical trial inclusion criterion:
Inclusion criteria controls: Matching patients on age (+/- 2 years), sex and parental socioeconomic status, Age 18-45 years, No psychiatric or physical disease.

Annotated entities:
- Observation: "controls"
- Non-representable: "Matching patients on age (+/- 2 years), sex and parental socioeconomic status"
- Person: "Age"
- Value: "18-45 years"
- Negation: "No"
- Condition: "psychiatric disease"
- Condition: "physical disease"